Clinical trial exclusion criterion:
Body weight > 140 kg

Entity relations:
- Has_value("Body weight", "> 140 kg")